¿Cuál de los siguientes tipos de receptores se encuentra en los ganglios tanto simpáticos como parasimpáticos del sistema nervioso vegetativo?
1. Nicotínicos.
2. Muscarínicos.
3. Beta1-adrenérgicos.
4. Alfa1-adrenérgicos.
5. Gabaérgicos.

Respuesta correcta: 1. Nicotínicos.